Clinical trial exclusion criterion:
Current use of any medication, including antiretrovirals, prohibited in the study (refer to the A5324 protocol-specific web page [PSWP] for the prohibited medications)

Entity relations:
- Subsumes("medication", "antiretrovirals")
- Has_qualifier("medication", "prohibited in the study")
- Has_temporal("medication", "Current")